有關日本血吸蟲之敘述，下列何者正確？(1) 台灣彰化王功地區曾有人體病例報告 (2)主要流行於遠東地區，中國大陸很多病例 (3)主要因尾動幼蟲經皮膚而感染 (4)它有二個中間宿主
A. (1)(2)
B. (2)(3)
C. (3)(4)
D. (1)(4)

正確答案：B. (2)(3)